王女士現年47歲，有乳癌的家族病史，最近接受衛生所安排乳癌篩檢。檢查後接到回信告知左側乳房有異常結果，邀請她到醫院接受進一步檢查。王女士到外科門診，她和醫師對檢查結果提出相關問題討論，下列敘述何者錯誤？
A. 乳房攝影檢查通常包含兩種檢視影像，其一為craniocaudal view，另一為mediolateral oblique view
B. 數位式的乳房攝影相較傳統式的優點，主要是能加強判讀乳房緻密的年輕族群
C. 乳房超音波檢查可以判斷病灶是否為實質性（solid）或囊狀性（cystic），也可以判斷病灶的外型，因此乳房超音波成為無症狀婦女篩檢乳癌的影像檢查首選
D. 乳房磁振照影檢查則對乳房緻密的年輕患者評估病灶，如侵襲性小葉癌（invasive lobular carcinoma）的範圍很有助益

正確答案：C. 乳房超音波檢查可以判斷病灶是否為實質性（solid）或囊狀性（cystic），也可以判斷病灶的外型，因此乳房超音波成為無症狀婦女篩檢乳癌的影像檢查首選